Clinical trial exclusion criterion:
SGLT2 inhibitor, TZD, DPP4 inhibitor and GLP1 RA use within the past 6 months

Entity relations:
- Has_temporal("SGLT2 inhibitor", "within the past 6 months")
- OR("SGLT2 inhibitor", "TZD", "DPP4 inhibitor", "GLP1 RA")